Can a circRNA be translated into protein?

Circ-ZNF609 is associated with heavy polysomes, and it is translated into a protein in a splicing-dependent and cap-independent manner, providing an example of a protein-coding circRNA in eukaryotes.
Circular RNAs (circRNAs) represent a large class of noncoding RNAs (ncRNAs) that have recently emerged as regulators of gene expression	
However, whether circRNAs encode functional proteins remains elusive, although translation of several circRNAs was recently reported